Clinical trial inclusion criterion:
Estradiol (E2) <= 3000 picogram/milliliter (pg/mL) at the human chorionic gonadotropin (HCG) triggering day (Day 0/Randomization)

Entity relations:
- Subsumes("the human chorionic gonadotropin (HCG) triggering day", "Day 0/Randomization")
- Has_index("at the human chorionic gonadotropin (HCG) triggering day", "the human chorionic gonadotropin (HCG) triggering day")
- Has_value("Estradiol (E2)", "<= 3000 picogram/milliliter (pg/mL)")
- Has_temporal("Estradiol (E2)", "at the human chorionic gonadotropin (HCG) triggering day")